Clinical trial inclusion criterion:
History of snake bite with features of local envenomation with/without systemic features

Annotated entities:
- Condition: "snake bite"
- Condition: "local envenomation"
- Mood: "features of"
- Condition: "systemic features"